下列何種藥物是透過拮抗 aldosterone receptor 而改善 congestive heart failure？
A. Eplerenone
B. Captopril
C. Digoxin
D. Milrinone

正確答案：A. Eplerenone